下列何種神經傷害適合使用對掌副木（opponens splint）？
A. 橈神經
B. 尺骨神經
C. 正中神經
D. 腋下神經

正確答案：C. 正中神經